在先天性心臟病的完全矯正，有時需使用帶有瓣膜的同種異體移植物（homograft of pulmonary artery or aorta, valved）來銜接右心室至肺動脈，下列那些先天性心臟病之完全矯正可能需要用到此移植物？ ①動脈幹症 （truncus arteriosus） ②肺靜脈回流完全異常 ③肺動脈瓣閉鎖合併心室中隔缺損 ④主動脈窄縮症
A. ①②
B. ①③
C. ②③
D. ①④

正確答案：B. ①③